proliferative retinopathy or autonomic neuropathy;

The above is a clinical trial exclusion criterion. Annotated with entity spans:
[Condition: proliferative retinopathy] or [Condition: autonomic neuropathy];